Clinical trial exclusion criterion:
Immunosuppression

Annotated entities:
- Condition: "Immunosuppression"